Previous bladder injection with onabotulinumtoxinA

The above is a clinical trial exclusion criterion. Annotated with entity spans:
Previous [Qualifier: bladder injection] with [Drug: onabotulinumtoxinA]